Denied consent

The above is a clinical trial exclusion criterion. Annotated with entity spans:
[Informed_consent: Denied consent]